Clinical trial exclusion criterion:
History of deep vein thrombosis, ischemic heart disease or stroke

Annotated entities:
- Condition: "deep vein thrombosis"
- Condition: "ischemic heart disease"
- Condition: "stroke"